42 歲李先生，罹患尿毒症，接受血液透析治療中。最近發現有表淺型膀胱癌，剛接受經尿道膀胱腫瘤切除術，他希望儘快能做腎臟移植，請問最理想的時間是？
A. 術後 3 個月
B. 術後 6 個月
C. 術後 1 年
D. 術後 2 年

正確答案：D. 術後 2 年